5歲男童因為生長激素受體的基因突變，造成新陳代謝障礙，所以無法長大。下列何者最適合改善此種症狀？
A. somatropin
B. octreotide
C. atosiban
D. mecasermin

正確答案：D. mecasermin